Clinical trial exclusion criterion:
Treatment with rifaximin or neomycin in the previous 7 days.

Entity relations:
- Has_temporal("rifaximin", "in the previous 7 days")
- OR("rifaximin", "neomycin")